Clinical trial exclusion criterion:
Metastatic disease to the breast.

Entity relations:
- Has_qualifier("Metastatic disease", "to the breast")